Una característica esencial de los plásmidos es:
1. Poder integrarse en el genoma de la célula hospedadora.
2. Dirigir el proceso de conjugación bacteriana.
3. Portar genes de resistencia a antibióticos.
4. Replicarse autónomamente.
5. Ser moléculas de DNA circular.

Respuesta correcta: 4. Replicarse autónomamente.